下列有關塵肺症（pneumoconioses）的敘述，何者錯誤？
A. 吸入礦物塵埃、有機塵埃、化學煙霧或蒸氣引起
B. 最易造成塵肺症的顆粒大小在5到10微米
C. 體積較小之顆粒較易引起急性肺傷害
D. 吸菸可加重吸入礦物塵埃造成的傷害

正確答案：B. 最易造成塵肺症的顆粒大小在5到10微米